Patients' bone stock is compromised by disease or infection, which cannot provide adequate support and/or fixation to the prosthesis

The above is a clinical trial exclusion criterion. Annotated with entity spans:
[Non-query-able: Patients' bone stock is compromised by disease or infection, which cannot provide adequate support and/or fixation to the prosthesis]